El atenolol es un antihipertensivo β-antagonista que pertenece a la familia estructural:
1. Ariletanolaminas.
2. Quinazolinas.
3. β-Haloalquilaminas.
4. Ariloxipropanolaminas.
5. 2-Imidazolinas.

Respuesta correcta: 4. Ariloxipropanolaminas.